List diseases that are caused by the Meningococcus B?

Both bacterial meningitis and septicemia can be caused by Meningococcus B